Clinical trial exclusion criterion:
Subjects with evidence of liver cirrhosis

Annotated entities:
- Condition: "liver cirrhosis"
- Mood: "evidence"